Clinical trial exclusion criterion:
Recurrent varicose veins

Entity relations:
- Has_multiplier("varicose veins", "Recurrent")